Clinical trial exclusion criterion:
Baseline ALT more than 3 times UNL

Entity relations:
- Has_value("ALT", "more than 3 times UNL")
- Has_temporal("ALT", "Baseline")